脂肪細胞不具下列何種酵素的活性？
A. triose phosphate isomerase
B. glycerol phosphate dehydrogenase
C. hexokinase
D. glycerol kinase

正確答案：D. glycerol kinase